下列那一種藥物為 Benzodiazepines 類鎮靜-催眠（sedative-hypnotic）藥物的拮抗劑（antagonist），其可以用來治療或診斷 Benzodiazepines 的急性中毒現象？
A. Buspirone
B. Zolpidem
C. Flumazenil
D. Zaleplon

正確答案：C. Flumazenil